Clinical trial exclusion criterion:
6. Ischemic heart failure without the revascularization or undergone the revascularization within last 6 months;

Annotated entities:
- Condition: "Ischemic heart failure"
- Procedure: "revascularization"
- Negation: "without"
- Procedure: "revascularization"
- Temporal: "within last 6 months"